呼吸訓練（respiratory training）最適宜用來輔助治療下列何種精神疾患？
A. 恐慌症（panic disorder）
B. 強迫症（obsessive-compulsive disorder）
C. 重鬱症（major depressive disorder）
D. 身體化症（somatization disorder）

正確答案：A. 恐慌症（panic disorder）